AFC> 10

The above is a clinical trial inclusion criterion. Annotated with entity spans:
[Measurement: AFC][Value: > 10]